Clinical trial inclusion criterion:
6. Has a 6-minute walk distance that is ≥150 and ≤500 meters.

Annotated entities:
- Parsing_Error: "6."
- Measurement: "6-minute walk distance"
- Value: "≥150 and ≤500 meters"